某政要的私人醫師因為診療的關係知道該政要一些個人的習慣，如飯後要抽菸、不愛吃蔬菜水果及如廁後常不洗手等。這位醫師希望為這位政要寫一本回憶錄，內容包括政要的生活習慣和個人喜好，在倫理及法律的規範下，他必須遵守下列何項限制？
A. 若未經政要同意，則必須等到政要逝世後才能公諸於世
B. 只能敘述與疾病及醫療無關的生活軼事
C. 只能敘述不會傷害政要本人或其他有關人員的事件
D. 刊載的所有內容必須得到政要本人或法律上具同意權者的同意

正確答案：D. 刊載的所有內容必須得到政要本人或法律上具同意權者的同意